El contenido o riqueza de determinados principios activos en una formulación tópica se expresa mediante las unidades:
1. Fracción molar.
2. mmol/L.
3. Unidades internacionales.
4. mEq/L.

Respuesta correcta: 3. Unidades internacionales.